Clinical trial inclusion criterion:
Sensitive to the product or other genetically engineered biological products from Escherichia coli strains.

Entity relations:
- Has_qualifier("genetically engineered biological products", "Escherichia coli strains")